Clinical trial exclusion criterion:
5. Diagnosis of degenerative cognitive impairment based on clinical and/or neuroradiological findings (i.e., patients with prevailing memory impairment, or with medial temporal atrophy on brain MRI in absence of evident vascular abnormalities; i.e., Alzheimer disease as defined using the National Institute of Neurological and Communicative Disorders and Stroke/Alzheimer's Disease and Related Disorders Association criteria, Parkinson disease, Huntington disease, frontotemporal dementia).

Annotated entities:
- Parsing_Error: "5."
- Condition: "degenerative cognitive impairment"
- Undefined_semantics: "degenerative cognitive impairment"
- Condition: "clinical and/or neuroradiological findings"
- Undefined_semantics: "clinical and/or neuroradiological findings"
- Condition: "memory impairment"
- Condition: "medial temporal atrophy"
- Procedure: "brain MRI"
- Negation: "absence"
- Condition: "vascular abnormalities"
- Subjective_judgement: "evident"
- Condition: "Alzheimer disease"
- Measurement: "National Institute of Neurological and Communicative Disorders and Stroke/Alzheimer's Disease and Related Disorders Association criteria"
- Condition: "Parkinson disease"
- Condition: "Huntington disease"
- Condition: "frontotemporal dementia"